器官移植是人類外科醫學一個重要突破，下列敘述何者錯誤？
A. 歷史上最早完成的器官移植為腎臟移植
B. 心臟移植比肝臟移植更早完成
C. 大多數的胰臟移植時常會合併腎臟移植一起進行
D. 超急性排斥發生於移植後數十分	到數小時，是因為接受者體內抗體攻擊捐贈器官上的血型相關抗原或人

正確答案：B. 心臟移植比肝臟移植更早完成